Clinical trial inclusion criterion:
Functionally impairing back pain: A baseline score of > 5 on the Roland-Morris Disability Questionnaire

Annotated entities:
- Qualifier: "Functionally impairing"
- Condition: "back pain"
- Measurement: "Roland-Morris Disability Questionnaire"
- Temporal: "baseline"
- Value: "score of > 5"